Clinical trial exclusion criterion:
Patients with past treatment failures of aripiprazole

Annotated entities:
- Drug: "aripiprazole"
- Observation: "treatment failures"